Clinical trial inclusion criterion:
not intending to move away from the clinic's catchment area for the next 2 years

Annotated entities:
- Non-query-able: "not intending to move away from the clinic's catchment area for the next 2 years"